Clinical trial inclusion criterion:
18 years of age and older,

Annotated entities:
- Value: "18 years and older"
- Person: "age"